Clinical trial exclusion criterion:
Chronic kidney disease (CrCl < 30ml/min)

Entity relations:
- Has_value("CrCl", "< 30ml/min")
- Subsumes("Chronic kidney disease", "CrCl")